Renal failure / patients undergoing dialysis

The above is a clinical trial exclusion criterion. Annotated with entity spans:
[Condition: Renal failure] / patients undergoing [Procedure: dialysis]